Which disease can be categorized using the Koos grading system?

Koos grading system is used for vestibular schwannoma.